Los movimientos rítmicos como andar o correr son:
1. Movimientos reflejos.
2. Movimientos voluntarios.
3. Iniciados y terminados por la corteza cerebral.
4. Una combinación de movimientos reflejos y voluntarios.
5. 3 y 4 son correctas.

Respuesta correcta: 5. 3 y 4 son correctas.